6 個月大的嬰兒尚未長牙，出生以來都以純母乳哺餵，體重正常，對於此嬰兒照護的最好建議，母親要：
A. 繼續哺餵母乳，但應開始添加副食品
B. 繼續哺餵母乳，但應給嬰兒補充鈣片
C. 開始斷母乳改以配方奶餵食，並添加副食品
D. 儘量改以稀飯、菜泥餵食為主，奶類為輔

正確答案：A. 繼續哺餵母乳，但應開始添加副食品